廖先生是一位 30 歲的國中老師，因結婚兩年來仍未有小孩而到泌尿科門診，這兩年來他們每週有一至兩次性行為，且未採取避孕措施，但廖太太從未懷孕過。理學檢查時發現廖先生兩側輸精管及睪丸大小正常，精液檢查發現精液量為三毫升，但未發現任何精蟲，血中濾泡刺激激素（FSH）正常，其可能的診斷為：
A. 性腺激素不足導致性腺功能不足（Hypogonadotropic hypogonadism）
B. Klinefelter's 症候群
C. 輸精管阻塞
D. 逆行性射精

正確答案：C. 輸精管阻塞